Clinical trial inclusion criterion:
Age: 60-85 years, right-handed;

Annotated entities:
- Person: "Age"
- Value: "60-85 years"
- Observation: "right-handed"